Clinical trial exclusion criterion:
Severe hepatic impairment

Entity relations:
- Has_qualifier("hepatic impairment", "Severe")